張先生於 2 週前，曾赴中國大陸湖南省洞庭湖從事遊湖活動，期間曾將手腳伸入水中戲水，並於當晚回旅館休息時發覺戲水的手腳部位出現搔癢紅疹，返臺後出現全身不適、發燒及咳嗽等症狀，經住院檢查發現有輕微肝脾腫大（hepatosplenomegaly）及急性肝炎（acute hepatitis）現象。依據上述 結果，張先生最可能感染何種寄生蟲？
A. 中華肝吸蟲（Clonorchis sinensis）
B. 橫川吸蟲（Metagonimus yokogawai）
C. 異形吸蟲（Heterophyes heterophyes）
D. 日本血吸蟲（Schistosoma japonicum）

正確答案：D. 日本血吸蟲（Schistosoma japonicum）